Emergent/elective

The above is a clinical trial inclusion criterion. Annotated with entity spans:
[Qualifier: Emergent]/[Qualifier: elective]